Clinical trial exclusion criterion:
No contraception.

Annotated entities:
- Procedure: "contraception"
- Negation: "No"